Clinical trial exclusion criterion:
5. Currently taking immunomodulatory medication, i.e. interferon.

Annotated entities:
- Drug: "immunomodulatory medication"
- Undefined_semantics: "immunomodulatory medication"
- Drug: "interferon"